epilepsy

The above is a clinical trial exclusion criterion. Annotated with entity spans:
[Condition: epilepsy]